¿Cuál de los siguientes comentarios realizados por una persona con Insuficiencia Renal en programa de Hemodiálisis denota una mayor necesidad de formación?:
1. “Debo comer más fruta y verdura, ¡aunque no me gusta nada!”.
2. “¡El chocolate ni lo huelo!”.
3. “No me puedo permitir el queso curado porque tengo el fosforo muy alto”.
4. “Debo limitar la cantidad de líquidos que tomo”.

Respuesta correcta: 1. “Debo comer más fruta y verdura, ¡aunque no me gusta nada!”.